下列何種骨折最易造成股骨頭部壞死？
A. 股骨幹粉碎性骨折（femoral shaft comminuted fracture）
B. 股骨轉子間骨折（femoral intertrochanteric fracture）
C. 股骨轉子下骨折（femoral subtrochanteric fracture）
D. 移位性股骨頸骨折（displaced femoral neck fracture）

正確答案：D. 移位性股骨頸骨折（displaced femoral neck fracture）